3. Ingestion of any vitamins or herbal products within the 48 hours prior to the initial dose of the study medication.

The above is a clinical trial exclusion criterion. Annotated with entity spans:
[Parsing_Error: 3.] [Not_a_criteria: Ingestion of any vitamins or herbal products within the 48 hours prior to the initial dose of the study medication.]